下列那些絛蟲在人類會引起自體感染（autoinfection）？①有鈎絛蟲（Taenia solium） ②廣節裂頭絛蟲（Diphyllobothrium latum） ③短小包膜絛蟲（Hymenolepis nana） ④顆粒性包生絛蟲（Echinococcus granulosus）
A. ①②
B. ①③
C. ②④
D. ③④

正確答案：B. ①③